Clinical trial exclusion criteria:
Open surgery;
Patients allergic to lidocaine or other local anesthetics;
Drug abuser.

Annotated entities:
- Procedure: "Open surgery"
- Condition: "allergic"
- Drug: "lidocaine"
- Drug: "local anesthetics"
- Qualifier: "other"
- Condition: "Drug abuser"